Clinical trial exclusion criterion:
Patients with a seizure history, history of recurrent falls, or known brain metastases are excluded from this clinical trial because of their poor prognosis and because of their heightened risk of seizure or progressive cognitive and/or neurologic dysfunction that would confound the evaluation.

Annotated entities:
- Condition: "seizure"
- Condition: "recurrent falls"
- Condition: "brain metastases"
- Temporal: "history"
- Temporal: "history of"